treatment with an investigational agent for any condition 60 days prior to enrollment.

The above is a clinical trial exclusion criterion. Annotated with entity spans:
[Competing_trial: treatment with an investigational agent for any condition 60 days prior to enrollment].